Liver function within normal range for age

The above is a clinical trial inclusion criterion. Annotated with entity spans:
[Measurement: Liver function] [Value: within normal range for age]